下列何種症狀較少見於 SARS（severe acute respiratory syndrome）感染患者？
A. fever, myalgia
B. rhinorrhea, sorethroat
C. lymphopenia, thrombocytopenia
D. diarrhea

正確答案：B. rhinorrhea, sorethroat